依據醫師法規定，醫師執行業務時應製作病歷。下列何者非醫師法明文列舉應包括之病歷內容？
A. 病人之姓名
B. 診斷
C. 造成傷病之外因
D. 檢查結果

正確答案：C. 造成傷病之外因